Clinical and radiographic evidence of FAI

The above is a clinical trial inclusion criterion. Annotated with entity spans:
[Qualifier: Clinical] and [Qualifier: radiographic evidence] of [Condition: FAI]